El término DOMINIO se refiere a:
1. Los extremos de las cadenas polipeptídicas de una proteína.
2. Segmentos compactos de las proteínas globulares, que son estructuralmente independientes y poseen funciones específicas.
3. Combinaciones de hélices alfa y hojas beta sin una función particular.
4. Cada una de las cadenas polipeptídicas individuales de un oligómero.
5. La estructura de las proteínas fibrosas.

Respuesta correcta: 2. Segmentos compactos de las proteínas globulares, que son estructuralmente independientes y poseen funciones específicas.